Clinical trial inclusion criterion:
Willing to complete all study visits

Annotated entities:
- Post-eligibility: "Willing to complete all study visits"